眼球欲往內下方向看，需靠下列那一組眼肌同時出力？
A. 內直肌和下直肌
B. 內直肌和下斜肌
C. 內直肌和上斜肌
D. 內直肌和上直肌

正確答案：C. 內直肌和上斜肌